5. The ulcer has > 50% slough, significant necrotic tissue, bone, tendon, or capsule exposure or avascular ulcer beds

The above is a clinical trial exclusion criterion. Annotated with entity spans:
[Parsing_Error: 5.] The [Condition: ulcer] has [Value: > 50%] [Measurement: slough], significant [Observation: necrotic tissue], [Observation: bone], [Observation: tendon], or [Observation: capsule exposure] or [Observation: avascular ulcer beds]